活化下列何種自主神經傳遞物質作用的受體，通常會抑制 adenylyl cyclase 的活性？
A. muscarinic M2 cholinoceptor
B. muscarinic M3 cholinoceptor
C. β1 adrenoceptor
D. β3 adrenoceptor

正確答案：A. muscarinic M2 cholinoceptor